Clinical trial inclusion criteria:
Newborns weighing 1.5kg or more at birth

Annotated entities:
- Person: "Newborns"
- Measurement: "weighing"
- Value: "1.5kg or more"
- Temporal: "at birth"